Clinical trial inclusion criterion:
Age = 15 years old

Annotated entities:
- Person: "Age"
- Value: "= 15 years old"